¿Cuál de los siguientes reactivos se utiliza en las yodometrías para valorar el yodo producido al reaccionar el yoduro potásico con el analito?:
1. Ce(SO4)2.
2. K2Cr2O7.
3. KMnO4.
4. Na2S2O3.

Respuesta correcta: 4. Na2S2O3.